¿Cuál de las siguientes hormonas facilita la eliminación de sodio por los riñones?
1. Aldosterona.
2. Péptido natriurético atrial (ANP).
3. Vasopresina (hormona antidiurética, ADH).
4. Angiotensina II.

Respuesta correcta: 2. Péptido natriurético atrial (ANP).